下列那一種病毒感染，目前沒有發展出有效預防的疫苗？
A. A 型肝炎病毒（Hepatitis A virus, HAV）
B. 人類免疫不全病毒（Human immunodeficiency virus, HIV）
C. 流行性感冒病毒（Influenza virus）
D. 小兒麻痺病毒（Poliovirus）

正確答案：B. 人類免疫不全病毒（Human immunodeficiency virus, HIV）